Patients with a history of an untreated malignancy (except local skin cancers)

The above is a clinical trial exclusion criterion. Annotated with entity spans:
Patients with a history of an [Qualifier: untreated] [Condition: malignancy] ([Negation: except] [Condition: local skin cancers])